Clinical trial exclusion criterion:
Receiving steroids at the time of transplantation or likely to need steroids after transplantation.

Entity relations:
- AND("Receiving", "steroids")
- Has_index("at the time of transplantation", "transplantation")
- Has_index("after transplantation", "transplantation")
- Has_temporal("steroids", "after transplantation")
- Has_mood("steroids", "likely to need")
- Has_temporal("Receiving", "at the time of transplantation")
- OR("Receiving", "steroids")